Patients whose parents refuse to consent.

The above is a clinical trial exclusion criterion. Annotated with entity spans:
[Non-query-able: Patients whose parents refuse to consent.]